The results of patients' blood tests are as follows:

The above is a clinical trial inclusion criterion. Annotated with entity spans:
[Non-query-able: The results of patients' blood tests are as follows:]